Clinical trial inclusion criteria:
Weight stable (<3 kg weight change within last 3 months)
Constant habitual activity patterns (no deviation > 1x/wk at 30 min/session within last 3 months)
Constant habitual diet patterns within last 3 months
Willingness to eat a chocolate-flavored snack at test sessions and two week training period
No allergies to any test foods
Not planning to change use of medications known to influence appetite or metabolism
Not diabetic
No history of GI pathology
Non-smoker for one year or more

Annotated entities:
- Measurement: "Weight"
- Qualifier: "stable"
- Value: "<3 kg weight change"
- Temporal: "within last 3 months"
- Condition: "Constant habitual activity patterns"
- Observation: "no deviation > 1x/wk at 30 min/session within last 3 months"
- Condition: "Constant habitual diet patterns"
- Temporal: "within last 3 months"
- Observation: "Willingness to eat a chocolate-flavored snack"
- Temporal: "at test sessions"
- Temporal: "at two week training period"
- Condition: "allergies"
- Negation: "No"
- Observation: "test foods"
- Mood: "planning to change"
- Drug: "medications known to influence appetite"
- Drug: "medications known to influence metabolism"
- Negation: "Not"
- Condition: "diabetic"
- Negation: "Not"
- Condition: "GI pathology"
- Temporal: "history"
- Negation: "No"
- Condition: "smoker"
- Negation: "Non"
- Temporal: "for one year or more"